下列對於懼社交症（social phobia）之敘述，何者為非？
A. 好發於青少年
B. 男性之盛行率較高
C. 與個體低自尊、害怕被批評有關
D. 在鑑別診斷上可能要先排除強迫症與懼曠症

正確答案：B. 男性之盛行率較高